Clinical trial exclusion criterion:
Patients with clinically symptomatic brain metastases

Entity relations:
- Has_context("brain metastases", "clinically symptomatic")